Clinical trial inclusion criterion:
General good health as established by medical history and physical examination

Annotated entities:
- Condition: "General good health"
- Qualifier: "established by medical history"
- Procedure: "physical examination"